有關 bullous emphysema 的手術適應症與方法之敘述，下列何者錯誤？
A. air leakage 而造成 pneumothorax
B. bullae 體積占據一半（50%）以上的單側胸腔
C. 手術時必須進行肺葉切除，以避免疾病復發
D. 無症狀且體積小的 bullae，通常可以觀察追蹤即可

正確答案：C. 手術時必須進行肺葉切除，以避免疾病復發